Coagulopathy or taking anticoagulants responsible an INR> 1.3 or a platelet count <75,000 per microL,

The above is a clinical trial exclusion criterion. Annotated with entity spans:
[Condition: Coagulopathy] or taking [Drug: anticoagulants] [Non-representable: responsible an] [Measurement: INR][Value: > 1.3] or a [Measurement: platelet count] [Value: <75,000 per microL],